¿Por qué mecanismo produce hiperprolactinemia el haloperidol?:
1. Bloqueo de los receptores de alfa 1 adrenérgicos.
2. Bloqueo de receptores alfa-2 adrenérgicos
3. Bloqueo de receptores H1.
4. Bloqueo de receptores de D2.
5. Bloqueo de receptores 5-HT2.

Respuesta correcta: 4. Bloqueo de receptores de D2.